El cambio de isotipo de inmunoglobulina afecta a:
1. Las regiones constantes de las cadenas pesadas.
2. Las regiones constantes de las cadenas ligeras.
3. La totalidad de las cadenas pesadas.
4. La totalidad de la molécula de inmunoglobulina.
5. Las regiones hipervariables de las cadenas pesadas.

Respuesta correcta: 1. Las regiones constantes de las cadenas pesadas.